Clinical trial exclusion criterion:
Hemodynamically unstable in need of acute treatment

Annotated entities:
- Condition: "Hemodynamically unstable"